在骨髓（bone marrow）中，B 細胞之分化與下列那一項無關？
A. RAG1/RAG2 酵素
B. 基質細胞（stromal cell）
C. 類型轉換重組（class switch recombination）
D. IL-7

正確答案：C. 類型轉換重組（class switch recombination）